Clinical trial exclusion criterion:
Thyroxin (stable dose for ≥ 30 days); The last use of any other prescription medication will need follow the criteria for all other cohorts, as outlined above.

Entity relations:
- Has_temporal("stable dose", "≥ 30 days")
- Has_qualifier("Thyroxin", "stable dose")